History of drug or alcohol abuse within the 12 months prior to dosing.

The above is a clinical trial exclusion criterion. Annotated with entity spans:
[Temporal: History] of [Condition: drug] or [Condition: alcohol abuse] [Temporal: within the 12 months prior] to dosing.